如果白人小孩的平均血漿醛固酮（plasma-aldosterone）為 400 pmol/L，標準差為 200 pmol/L，假設血漿醛固酮為常態分布，有多少百分比的白人小孩其血漿醛固酮≤300 pmol/L？（Pr(Z≥0.5)）＝0.3085
A. 30.85
B. 19.15
C. 69.15
D. 38.30

正確答案：A. 30.85